Active consumption of alcohol and/or drugs

The above is a clinical trial exclusion criterion. Annotated with entity spans:
[Qualifier: Active] [Condition: consumption of alcohol] and/or [Condition: drugs]